Clinical trial exclusion criterion:
Epileptic status

Annotated entities:
- Condition: "Epileptic status"